Clinical trial inclusion criterion:
Patient presents with acute coronary syndrome (ACS) or stable coronary artery disease (CAD)

Entity relations:
- Subsumes("acute coronary syndrome", "ACS")
- Subsumes("coronary artery disease", "CAD")
- Has_qualifier("coronary artery disease", "stable")
- OR("acute coronary syndrome", "coronary artery disease")